血管受到傷害時，其鄰近之血管內皮細胞會釋放下列何種物質以防止血小板凝集狀態的擴散？
A. 維生素K及胞漿素（plasmin）
B. 凝血脂素A2（thromboxane A2）
C. 纖維蛋白原（fibrinogen）及鈣離子
D. 一氧化氮（nitric oxide）及prostacyclin（PGI2）

正確答案：D. 一氧化氮（nitric oxide）及prostacyclin（PGI2）